Mujer de 75 años, con menopausia a los 52 años, sin antecedentes familiares ni personales de fractura, diagnosticada de arteritis de la temporal, que va a iniciar tratamiento con prednisona a dosis altas y con expectativa de tratamiento durante al menos un año. La demora de densitometría (DXA) en su centro es de 4-5 meses. Se plantea tratamiento preventivo de osteoporosis. Entre las siguientes ¿cuál es la actitud más adecuada?:
1. Solicitar DXA y esperar al resultado.
2. Valorar riesgo absoluto de fractura mediante el cuestionario FRAX sin DMO y tratar sólo si es alto.
3. Iniciar tratamiento con Bisfosfonatos y vitamina D (800 UI/día).
4. Administrar suplemento de calcio (1g) y vitamina D (800 UI/día).
5. Valorar si tiene osteopenia en las radiografías y tratar si está presente.

Respuesta correcta: 3. Iniciar tratamiento con Bisfosfonatos y vitamina D (800 UI/día).